What type of antagonist is istradefylline?

Istradefylline is a selective adenosine A2A receptor antagonist.